Clinical trial exclusion criterion:
History of interstitial lung disease (ILD) e.g., interstitial pneumonitis, pulmonary fibrosis or evidence of ILD on baseline chest computer tomography.

Entity relations:
- Subsumes("interstitial lung disease", "ILD")
- Has_temporal("chest computer tomography", "baseline")
- Has_mood("ILD", "evidence of")
- AND("chest computer tomography", "ILD")
- Subsumes("interstitial lung disease", "interstitial pneumonitis")
- OR("interstitial pneumonitis", "chest computer tomography", "pulmonary fibrosis")